Serum creatinine > 3 mg/dl

The above is a clinical trial exclusion criterion. Annotated with entity spans:
[Measurement: Serum creatinine] [Value: > 3 mg/dl]